下列有關 E. coli DNA 複製之敘述，何者正確？
A. 複製原點（replication origin）附近有許多富含 GU 之序列
B. 由 DNA 聚合酶 I 負責前導股（leading strand）之合成
C. 需要從一段 RNA 引子（primer）開始合成
D. 單股 DNA 結合蛋白（single-strand DNA-binding proteins）負責打開雙股

正確答案：C. 需要從一段 RNA 引子（primer）開始合成